Clinical trial exclusion criterion:
any serious adverse events that have a causal relationship with the inoculation of the upper dose of the vaccine

Entity relations:
- Has_qualifier("adverse events", "serious")
- AND("adverse events", "inoculation of the upper dose of the vaccine")